¿Cuáles son las principales funciones de los mandos o dirigentes de una organización?:
1. Control, supervisión, información y comunicación.
2. Reclutamiento, selección, contratación y supervisión.
3. Planificación, organización, ejecución/ dirección y control.
4. Dirección, evaluación, autorización/ denegación y comunicación.
5. Contratación, formación, acreditación y aprobación.

Respuesta correcta: 3. Planificación, organización, ejecución/ dirección y control.